Clinical trial exclusion criterion:
Previous intracranial bleeding

Entity relations:
- Has_temporal("intracranial bleeding", "Previous")